Clinical trial exclusion criterion:
Serum potassium < 3.5 mmol/L or >5.5 mmol/L

Entity relations:
- Has_value("Serum potassium", "< 3.5 mmol/L")
- OR("< 3.5 mmol/L", ">5.5 mmol/L")